Clinical trial inclusion criterion:
High risk for HIV infection

Entity relations:
- Has_mood("HIV infection", "High risk for")